Clinical trial inclusion criteria:
croup children between 6 month and 5 years old
Westley croup score between 3 and 11

Annotated entities:
- Value: "between 6 month and 5 years"
- Person: "old"
- Person: "children"
- Measurement: "Westley croup score"
- Value: "between 3 and 11"